Creatinine > 1.5 mg/dL

The above is a clinical trial exclusion criterion. Annotated with entity spans:
[Measurement: Creatinine] [Value: > 1.5 mg/dL]